Previous history of pneumonitis.

The above is a clinical trial exclusion criterion. Annotated with entity spans:
Previous [Temporal: history] of [Condition: pneumonitis].